Endoscopic insertion of video capsule endoscope

The above is a clinical trial exclusion criterion. Annotated with entity spans:
[Procedure: Endoscopic insertion] of [Device: video capsule endoscope]